一位40歲的男性，有頸部疼痛酸麻且會延伸到左側前臂及手掌中指部位。病患步態穩定，肌力完整，左側三頭肌 （triceps）之深層肌腱反射，有減弱狀況。初步的診斷為頸椎椎間盤突出合併神經壓迫，最可能的病灶為何？
A. 第三、四頸椎椎間盤
B. 第四、五頸椎椎間盤
C. 第五、六頸椎椎間盤
D. 第六、七頸椎椎間盤

正確答案：D. 第六、七頸椎椎間盤